Informed consent signed

The above is a clinical trial inclusion criterion. Annotated with entity spans:
[Non-query-able: Informed consent signed]